Ankle-brachial index above 0,40 or presence of palpable pulses in arteria dorsalis pedes and/or arteria tibialis posterior

The above is a clinical trial inclusion criterion. Annotated with entity spans:
[Measurement: Ankle-brachial index] [Value: above 0,40] or presence of [Condition: palpable pulses] in [Reference_point: arteria dorsalis pedes] and/or [Reference_point: arteria tibialis posterior]